Clinical trial exclusion criterion:
Administration of long-acting immune-modifying drugs at any time during the study period

Annotated entities:
- Drug: "immune-modifying drugs"
- Temporal: "at any time during the study period"
- Reference_point: "the study period"
- Qualifier: "long-acting"